Clinical trial inclusion criterion:
end diastolic diameter >60 mm and/or an ejection fraction <50%

Annotated entities:
- Measurement: "end diastolic diameter"
- Value: ">60 mm"
- Measurement: "ejection fraction"
- Value: "<50%"